Clinical trial inclusion criterion:
2. Histologic documentation of the original primary tumor.

Entity relations:
- Has_value("Histologic", "documentation")
- AND("original primary tumor", "Histologic")